Respecto a la enfermedad por reflujo gastroesofágico, ¿cuál de los siguientes enunciados es cierto?
1. La intensidad y frecuencia de pirosis tiene poca relación con la presencia y gravedad de esofagitis endoscópica.
2. La mayoría de los pacientes con enfermedad por reflujo gastroesofágico presentan esofagitis en la endoscopia.
3. El tratamiento con inhibidores de la bomba de protones suele conseguir un buen control de los síntomas pero no es superior a placebo en la curación endoscópica de la esofagitis.
4. El esófago de Barrett puede progresar a displasia epitelial de bajo grado, displasia epitelial de alto grado y finalmente a carcinoma escamoso de esófago.
5. Los programas endoscópicos de cribado y vigilancia han demostrado de forma inequívoca ser capaces de reducir la mortalidad en pacientes con esófago de Barrett.

Respuesta correcta: 1. La intensidad y frecuencia de pirosis tiene poca relación con la presencia y gravedad de esofagitis endoscópica.